Clinical trial inclusion criterion:
Current PTSD diagnosis

Entity relations:
- Has_temporal("PTSD", "Current")